Subjects who have not reached the prescribed period after receiving contraindicated medication or treatment before participation in this clinical trial.

The above is a clinical trial exclusion criterion. Annotated with entity spans:
[Non-representable: Subjects who have not reached the prescribed period after receiving contraindicated medication or treatment before participation in this clinical trial.]